下列何項皮膚表徵並非異位性皮膚炎（atopic dermatitis）的臨床診斷依據？
A. 慢性期，有眼眶周圍色素沉著（periorbital pigmentation）
B. 慢性期，有 Dennie-Morgan 現象
C. 幼兒期，苔癬化皮膚病變特別容易出現在手肘及膝蓋的伸側
D. 在患部皮膚，有白色皮膚畫紋症（white dermatographism）

正確答案：C. 幼兒期，苔癬化皮膚病變特別容易出現在手肘及膝蓋的伸側